History of an adverse reaction to Cortrosyn™ or similar test reagents

The above is a clinical trial exclusion criterion. Annotated with entity spans:
History of an [Condition: adverse reaction] to [Qualifier: Cortrosyn]™ or [Qualifier: similar test reagents]